Clinical trial exclusion criterion:
Requirement for treatment with both ACEIs and ARBs.

Entity relations:
- Has_mood("treatment", "Requirement for")
- AND("treatment", "ACEIs")
- OR("ACEIs", "ARBs")